¿Cuál es el mecanismo responsable de la excreción de fármacos por vía biliar?:
1. Difusión pasiva.
2. Transporte activo.
3. Pinocitosis.
4. Fagocitosis.

Respuesta correcta: 2. Transporte activo.